Clinical trial exclusion criterion:
Current diagnostic of asthma

Annotated entities:
- Temporal: "Current"
- Condition: "diagnostic of asthma"